Las entrevistas clínicas estructuradas y semiestructuradas se basan en:
1. El análisis de las conductas problema.
2. La exploración inicial y la demanda del cliente.
3. Las categorías y los criterios diagnósticos.
4. La observación del comportamiento no verbal.
5. El ajuste de la demanda del paciente y la hipótesis funcional.

Respuesta correcta: 3. Las categorías y los criterios diagnósticos.